Subject has an allergy or other known contraindication to the medications used in the study.

The above is a clinical trial exclusion criterion. Annotated with entity spans:
Subject has an [Condition: allergy] or other known [Condition: contraindication] to the [Drug: medications used in the study].